¿Cuál es la finalidad de las reglas de Lipinski?
1. Describen las propiedades adecuadas para que un fármaco se pueda utilizar por vía oral.
2. Describen las propiedades adecuadas para que un fármaco genere metabolitos poco tóxicos.
3. Proporcionan unas directrices generales que facilitan la planificación de la síntesis de fármacos.
4. Describen las propiedades adecuadas para que un fármaco se acumule en el sistema nervioso central.

Respuesta correcta: 1. Describen las propiedades adecuadas para que un fármaco se pueda utilizar por vía oral.